El trastorno en la articulación y expresión del habla por lesiones del sistema nervioso central o periférico, se denomina:
1. Disartria.
2. Disglosia.
3. Disfasia.
4. Distonia.

Respuesta correcta: 1. Disartria.